Gastrointestinal disease,

The above is a clinical trial exclusion criterion. Annotated with entity spans:
[Condition: Gastrointestinal disease],